Clinical trial exclusion criteria:
cognitive impairment (Mini-Mental Status Examination score: illiterate 13 points; elementary and middle school 18 points; and high-school 26 points; or inability to respond to verbal command);
inability to walk independently for at least 10 minutes, with or without walking devices;
pain or other disorders precluding their participation.

Annotated entities:
- Condition: "cognitive impairment"
- Measurement: "Mini-Mental Status Examination score"
- Observation: "illiterate"
- Value: "13 points"
- Observation: "elementary"
- Observation: "middle school"
- Value: "18 points"
- Observation: "high-school"
- Value: "26 points"
- Condition: "inability to respond to verbal command"
- Condition: "inability to walk independently"
- Qualifier: "at least 10 minutes"
- Device: "walking devices"
- Condition: "pain"
- Condition: "other disorders"
- Qualifier: "precluding their participation"
- Post-eligibility: "pain or other disorders precluding their participation"